7天大男嬰，發現有呼吸窘迫、發紺及心雜音。呼吸次數每分鐘60次合併厲害胸凹（Subcostal retraction）現象，肝臟下緣位於右肋骨下4公分，右手血壓為90/50 mmHg，左手及下肢血壓約為60/45 mmHg。下列敘述何 者錯誤？
A. 需要給與前列腺素（Prostaglandin E1）
B. 常合併胸腺發育不良（Thymic hypoplasia）
C. 常合併臉部異常及顎裂（Cleft palate）
D. 常合併血中鈣離子偏高（Hypercalcemia）

正確答案：D. 常合併血中鈣離子偏高（Hypercalcemia）